La metformina se recomienda como tratamiento inicial en la mayoría de consensos de tratamiento de la diabetes tipo 2, por eficacia, seguridad y precio; no obstante su utilización tiene algunas limitaciones y es obligado suspenderla en algunas situaciones clínicas. ¿En cuál de las siguientes situaciones NO consideraría suspender este tratamiento?
1. Introducción de análogo de insulina de acción prolongada por mal control metabólico.
2. Ingesta de alcohol superior a 50 g/día de forma habitual.
3. Realización de TC con contraste intravenoso.
4. Cuadro diarreico con elevación de Cr plasmática a 2,5 mg/dL.
5. Isquemia aguda de extremidades inferiores con importante hipoxia tisular.

Respuesta correcta: 1. Introducción de análogo de insulina de acción prolongada por mal control metabólico.